Use of a non-prescription drug and herbal substances during the study (through the Final Study Visit). The last dose of any non-prescription drug must have been taken greater than 5 half-lives for that drug before receiving study drug.

The above is a clinical trial exclusion criterion. Annotated with entity spans:
Use of a [Drug: non-prescription drug] [Grammar_Error: and] [Drug: herbal substances] [Temporal: during the study] (through the Final Study Visit). The last dose of [Drug: any non-prescription drug] must have been taken [Temporal: greater than 5 half-lives] for that drug before receiving study drug.